Clinical trial exclusion criterion:
Contraindication of MRI Claustrophobia Metallic hazards Pacemaker implant eGFR<30 ml/min

Entity relations:
- AND("Contraindication", "MRI")
- Has_value("eGFR", "<30 ml/min")
- Subsumes("Contraindication", "Claustrophobia")
- OR("Claustrophobia", "Metallic hazards", "Pacemaker implant", "eGFR")